preoperative use of either pregabalin, gabapentin or strong opiates

The above is a clinical trial exclusion criterion. Annotated with entity spans:
[Temporal: preoperative] use of either [Drug: pregabalin], [Drug: gabapentin] or [Drug: strong opiates]